What is the role of the AIMS65 score?

AIMS65 score is used to predict outcomes after upper GI bleeding.